有關γ-aminobutyric acid（GABA）receptor complex的描述何者錯誤？
A. Zolpidem的作用機轉與GABA receptor complex有關
B. 與抗焦慮效果相關
C. Buspirone可以結合上GABA receptor complex
D. 與抑制效果相關

正確答案：C. Buspirone可以結合上GABA receptor complex